Pregnant or lactating female and female of childbearing potential.

The above is a clinical trial exclusion criterion. Annotated with entity spans:
[Condition: Pregnant] or [Condition: lactating] [Person: female] and [Person: female] of [Condition: childbearing potential].